有關老年人孤立性收縮性高血壓（isolated systolic hypertension）的敘述，何者為誤？
A. 主要的血行動力缺陷（hemodynamic fault）是中階動脈（median artery）的膨脹性（distensibility）減少
B. 年齡以外，動脈硬化和高血壓是兩個主要的加速因素
C. 主要是因為主動脈血管的彈力蛋白（elastin）被膠原（collagen）和纖維組織（fibrous tissue）取代
D. 對心血管的傷害來自每次心跳血管承受的脈波（pulsatility）和從周邊血管快速回應的動脈脈搏更促進收縮血壓升高

正確答案：A. 主要的血行動力缺陷（hemodynamic fault）是中階動脈（median artery）的膨脹性（distensibility）減少